Clinical trial exclusion criterion:
Subject has any history of successful or unsuccessful treatment of AF with class I or III antiarrhythmic or sotalol with the intention to prevent an AF recurrence. Patients pretreated with above AAD at maximum 48 hours with the intention to convert an AF episode are allowed.

Annotated entities:
- Condition: "AF"
- Drug: "antiarrhythmic"
- Drug: "sotalol"
- Qualifier: "class I"
- Qualifier: "class III"
- Non-query-able: "with the intention to prevent an AF recurrence. Patients pretreated with above AAD at maximum 48 hours with the intention to convert an AF episode are allowed"